利用 Sanger method 定序 DNA，使用之試劑 dideoxy analog 具有下列那一種功能？
A. 可中止 DNA 合成
B. 水解斷裂 DNA 之磷酯鍵
C. 是合成引子（primer）的成分
D. 合成沒有 5'端磷酸根之 DNA

正確答案：A. 可中止 DNA 合成